Clinical trial exclusion criterion:
Poorly controlled pulmonary disease (severe asthma or COPD) -Contraindication to regional anesthesia (recent anticoagulant use)

Annotated entities:
- Qualifier: "Poorly controlled"
- Condition: "pulmonary disease"
- Qualifier: "severe"
- Condition: "asthma"
- Condition: "COPD"
- Condition: "Contraindication"
- Procedure: "regional anesthesia"
- Temporal: "recent"
- Drug: "anticoagulant"